Mujer de 69 años que consulta por disuria y polaquiuria, síntomas que ha sufrido en numerosas ocasiones en los últimos dos años. Cuenta que desde hace 3 meses está tomando cotrimoxazol en dosis diaria nocturna, recetado por su médico de cabecera. En el servicio de Urgencias del hospital se le cursó un sedimento y un cultivo de orina. El sedimento urinario fue patológico    (piuria     significativa,  nitritos positivos). Se le prescribió ciprofloxacino, y se le citó de nuevo con su médico de Atención Primaria.      El urocultivo resultó positivo (Escherichia coli, >10 (5) UFC/ml) y el resultado del antibiograma informaba de resistencia a ampicilina, cotrimoxazol y quinolonas, pero sensibilidad a fosfomicina, antimicrobiano que usted le prescribe. ¿Cuál de las siguientes respuestas es FALSA?
1. El cambio de ciprofloxacino por norfloxacino hubiera sido correcto, según los resultados del antibiograma.
2. Cotrimoxazol estaba siendo empleado como una profilaxis.
3. La elección de fosfomicina constituye un tratamiento dirigido.
4. La elección de ciprofloxacino constituye un tratamiento empírico.
5. El cambio de ciprofloxacino por fosfomicina fue correcto, según los resultados del antibiograma.

Respuesta correcta: 1. El cambio de ciprofloxacino por norfloxacino hubiera sido correcto, según los resultados del antibiograma.